Clinical trial inclusion criterion:
Symptomatic or asymptomatic metastatic breast cancer.

Entity relations:
- Has_qualifier("metastatic breast cancer", "Symptomatic")
- OR("Symptomatic", "asymptomatic")